Which syndromes are associated with heterochromia iridum?

The syndromes that are associated with heterochromia iridum are:
1) Ascher's syndrome
2) Waardenburg Syndrome type II (WS2)
3) Horner's syndrome.